En la determinación de la dureza del agua debida a la presencia de iones Ca2+ y Mg2+ se utiliza como reactivo valorante:
1. Naranja de metilo.
2. Una disolución estándar de cloruro potásico.
3. Negro Eriocromo T.
4. Una disolución estándar de ácido etilendiaminotetraacético (AEDT).
5. Una disolución de AEDT previamente estandarizada frente a una disolución de ftalato potásico.

Respuesta correcta: 4. Una disolución estándar de ácido etilendiaminotetraacético (AEDT).